下列那一種顱內腫瘤多半具有一層薄的莢膜，而且比較不具浸潤性？
A. 室管膜瘤（ependymoma）
B. 腦膜瘤（meningioma）
C. 神經膠母細胞瘤（glioblastoma）
D. 寡突膠細胞瘤（oligodendroglioma）

正確答案：B. 腦膜瘤（meningioma）